Clinical trial inclusion criterion:
Patients taking high potency opioid analgesics (e.g., methadone, hydromorphone, morphine)

Annotated entities:
- Drug: "high potency opioid analgesics"
- Drug: "methadone"
- Drug: "hydromorphone"
- Drug: "morphine"